黃麴毒素損害的主要器官是：
A. 肺臟
B. 肝臟
C. 腎臟
D. 脾臟

正確答案：B. 肝臟